¿Cuál de las siguientes hebras del DNA tiene la misma secuencia de nucleótidos (excepto el cambio de T por U) que su transcrito primario?
1. La hebra adelantada.
2. La hebra Watson.
3. La hebra Crick.
4. La hebra molde.
5. La hebra codificante.

Respuesta correcta: 5. La hebra codificante.